Clinical trial inclusion criterion:
treated with rituximab-based immunochemotherapy

Annotated entities:
- Qualifier: "rituximab-based"
- Drug: "rituximab"
- Procedure: "immunochemotherapy"